Presence or history of autoimmune disease as judged by the investigator

The above is a clinical trial exclusion criterion. Annotated with entity spans:
[Parsing_Error: Presence or history] of [Condition: autoimmune disease] [Subjective_judgement: as judged by the investigator]